Unable or unwilling to provide informed consent.

The above is a clinical trial exclusion criterion. Annotated with entity spans:
[Informed_consent: Unable or unwilling to provide informed consent].